下列何者位於後縱隔？
A. 心臟
B. 胸主動脈
C. 下腔靜脈
D. 氣管

正確答案：B. 胸主動脈